以帶血的乳頭分泌物（bloody discharge）呈現的乳房疾病，下列何種 常見？
A. 乳管內乳突瘤（intraductal papilloma）
B. 乳管原位癌（ductal carcinoma in situ）
C. 侵襲性乳管癌（invasive ductal carcinoma）
D. 派吉特氏病（Paget's disease）

正確答案：A. 乳管內乳突瘤（intraductal papilloma）